Adult men and women (=18 years).

The above is a clinical trial inclusion criterion. Annotated with entity spans:
[Person: Adult] [Person: men] and [Person: women] ([Value: =18 years]).